一位 22 歲不孕症婦女在 6 天前接受取卵手術，共取出 20 顆卵子，2 天後植入 3 個胚胎。今天來到急診，主訴呼吸困難、腹脹、噁心、小便減少。超音波發現兩側卵巢腫大約 6 公分、有大量腹水。下列那一項處置不適合？
A. 打利尿劑 Lasix
B. 抽血驗 CBC，electrolytes，GPT（ALT），BUN，creatinine
C. 抽腹水
D. 給予大量 normal saline

正確答案：A. 打利尿劑 Lasix